Where is fatty acid binding protein 2 expressed?

fatty acid binding protein 2 is expressed by intestinal epithelial cells